Patients with dexterity insufficiency of hands

The above is a clinical trial exclusion criterion. Annotated with entity spans:
Patients with [Condition: dexterity insufficiency of hands]